Clinical trial exclusion criterion:
School districts that are too difficult to reach (more than a 3-hour walk from the farthest place reachable by a four-wheel drive vehicle)

Entity relations:
- Has_value("walk from the farthest place reachable by a four-wheel drive vehicle", "more than a 3-hour")